Gleason score = 7 (3+4 and/or 4+3) and/or

The above is a clinical trial inclusion criterion. Annotated with entity spans:
[Measurement: Gleason score] [Value: = 7] ([Value: 3+4] and/or [Value: 4+3]) and/or